Clinical trial inclusion criterion:
No subjects will be excluded based on their race, religion, ethnicity, gender or HIV status.

Annotated entities:
- Non-representable: "No subjects will be excluded based on their race, religion, ethnicity, gender or HIV status."